Clinical trial exclusion criterion:
Patients previously treated with steroid, anti-cancer medicine, or immunosuppression treatment before CA;

Entity relations:
- Has_temporal("immunosuppression treatment", "before CA")
- Has_temporal("treated", "previously")
- AND("treated", "steroid")
- OR("steroid", "anti-cancer medicine")
- OR("treated", "immunosuppression treatment")